最常引起骨增生性之轉移性癌症是：
A. 大腸癌
B. 前列腺癌
C. 腎細胞癌
D. 肝癌

正確答案：B. 前列腺癌